一位 70 歲老先生，坐著與朋友聊天時，突然停止談話，嘴也不自主地作吞嚥動作，1 - 2 分鐘後，意識模糊，3 - 5 分鐘後清醒過來，卻不知道發生了什麼事，最可能之診斷是：
A. 失神型癲癇（petit mal epilepsy）
B. 暈厥症（syncope）
C. 暫時性全盤失憶症（transient global amnesia）
D. 複雜型局部癲癇（complex partial seizure）

正確答案：D. 複雜型局部癲癇（complex partial seizure）